Positive hepatitis B surface antigen, positive hepatitis C antibody or positive HIV test at screening or a history of positive testing (e.g. liver biopsy, serology) suggesting acute or chronic hepatitis.

The above is a clinical trial exclusion criterion. Annotated with entity spans:
[Value: Positive] [Measurement: hepatitis B surface antigen], [Value: positive] [Measurement: hepatitis C antibody] or [Value: positive] [Measurement: HIV test] [Temporal: at screening] or a [Temporal: history] of [Value: positive] [Procedure: testing] (e.g. [Procedure: liver biopsy], [Procedure: serology]) suggesting [Condition: acute] or [Condition: chronic hepatitis].